Clinical trial inclusion criterion:
Feasibility of patch testing.

Entity relations:
- Has_mood("patch testing", "Feasibility of")